針對創傷病人進行早期復甦治療目標（goal of early resuscitation）的要求敘述，下列何者錯誤？
A. 維持hematocrit於25～30%間
B. 維持中心體溫35℃以上
C. 維持血小板50000/cumm以上
D. 維持收縮血壓100～140 mmHg

正確答案：D. 維持收縮血壓100～140 mmHg